Clinical trial exclusion criterion:
History of receiving any investigational treatment within approximately 28 days prior to randomization.

Annotated entities:
- Procedure: "investigational treatment"
- Temporal: "within approximately 28 days prior to randomization"
- Reference_point: "randomization"
- Temporal: "History of"